懷孕早期感染德國麻疹，可能造成的疾病，下列何者除外？
A. 先天性耳聾
B. 心臟病
C. 白內障
D. 大腦鈣化

正確答案：D. 大腦鈣化